下列何者會製造人類絨毛膜促性腺激素（human chorionic gonadotrophin）？
A. 腦下腺（pituitary gland）前葉
B. 融合滋養層（syncytiotrophoblast）
C. 黃體（corpus luteum）
D. 蛻膜（decidua）

正確答案：B. 融合滋養層（syncytiotrophoblast）